Clinical trial exclusion criterion:
Anti-hypertensive therapy received in the past 12 hours

Entity relations:
- Has_temporal("Anti-hypertensive therapy", "past 12 hours")